Minimum of 2 mm of keratinized gingiva

The above is a clinical trial inclusion criterion. Annotated with entity spans:
[Value: Minimum of 2 mm] of [Measurement: keratinized gingiva]